一位 15 歲男孩因為重症肌無力（myasthenia gravis）導致呼吸困難及眼瞼下垂。經過一年半的類固醇治療後，上述症狀逐漸改善，但是男孩開始覺得視力模糊且持續惡化中，請問他最可能有下列那種情況？
A. 重症肌無力影響到眼外肌，使眼睛無法調視對焦
B. 重症肌無力導致視神經發炎
C. 類固醇治療導致嚴重遠視，使看遠看近都不清楚
D. 類固醇治療導致青光眼

正確答案：D. 類固醇治療導致青光眼